Clinical trial inclusion criterion:
Adequate renal function: Creatinine clearance <1.5 times ULN concurrent with creatinine clearance >50 ml/min.

Entity relations:
- Has_value("Creatinine clearance", "<1.5 times ULN")
- Has_value("creatinine clearance", ">50 ml/min")
- Has_temporal("Creatinine clearance", "concurrent")
- Has_temporal("creatinine clearance", "concurrent")
- Has_value("renal function", "Adequate")
- Subsumes("Adequate", "Creatinine clearance")
- Subsumes("Adequate", "creatinine clearance")